一位 57 歲男性病患因為全身倦怠、失眠、食慾不振以及呼吸困難而住院，他患有高血壓、糖尿病多年，正接受胰島素治療。過去半年每個月檢查的 creatinine 數值依序為 5.2 mg/dL，6.7 mg/dL，6.4 mg/dL， 7.0 mg/dL，7.2 mg/dL。住院檢查的結果為 Hb 9.2 g/dL，BUN 106 mg/dL，creatinine 9.6 mg/dL，albumin 2 g/dL，spot urine protein 923 mg/dL，胸部 X 光呈現兩側肋膜積水。最優先的處置為何？
A. 血液透析（hemodialysis）
B. 輸血（blood transfusion）
C. 輸白蛋白（albumin）
D. 給予血管張力素轉化酵素抑制劑（angiotensin-converting enzyme inhibitors）

正確答案：A. 血液透析（hemodialysis）